¿Qué estudio de trombofilia tendría interés en una mujer con abortos de repetición?
1. Determinación de fibrinógeno.
2. Proteína C-reactiva.
3. PAI-1.
4. Anticoagulante lúpico.
5. Tiempo de reptilase.

Respuesta correcta: 4. Anticoagulante lúpico.